Pilocytic astrocytoma屬於WHO classification system of glioma中的：
A. Grade 1
B. Grade 2
C. Grade 3
D. Grade 4

正確答案：A. Grade 1